醫師解剖一位 50 歲的男性，發現其腹腔內有白粉筆樣的脂肪壞死、出血區及雞湯樣液體，此病理變化最可能是下列那一項引起？
A. 消化性潰瘍穿孔（Perforated peptic ulcer）
B. 缺血性結腸炎（Ischemic colitis）
C. 漿液性腺癌（Serous adenocarcinoma）
D. 急性出血性胰臟炎（Acute hemorrhagic pancreatitis）

正確答案：D. 急性出血性胰臟炎（Acute hemorrhagic pancreatitis）